Clinical trial exclusion criterion:
don't have heart disease

Entity relations:
- Has_negation("heart disease", "don't have")